= 2 mm ST-elevation across 2 contiguous precordial leads (V1-V6) or leads I and aVL for a minimum combined total of = 4 mm ST-elevation or

The above is a clinical trial inclusion criterion. Annotated with entity spans:
[Non-query-able: = 2 mm ST-elevation across 2 contiguous precordial leads (V1-V6) or leads I and aVL for a minimum combined total of = 4 mm ST-elevation] or